Clinical trial exclusion criterion:
Patients with a history of allergy or hypersensitivity to tramadol.

Entity relations:
- AND("allergy", "tramadol")
- OR("allergy", "hypersensitivity")